General Condition WHO 0, 1 or 2,

The above is a clinical trial inclusion criterion. Annotated with entity spans:
[Measurement: General Condition WHO] [Value: 0], [Value: 1] or [Value: 2],